Clinical trial inclusion criterion:
PSA = 2 ng/mL at screening

Entity relations:
- Has_value("PSA", "= 2 ng/mL")